Clinical trial exclusion criterion:
current self-medication with UU preparations e.g. z.B. Cystinol®, Uvalysat®, Arctuvan®

Annotated entities:
- Drug: "UU preparations"
- Drug: "z.B. Cystinol®"
- Drug: "Uvalysat®"
- Drug: "Arctuvan®"
- Qualifier: "self-medication"